El gen implicado en la Hemofilia A se localiza en la región cromosómica:
1. Xp28.
2. Xq28
3. 17p12.
4. 18q22.

Respuesta correcta: 2. Xq28